Clinical trial exclusion criterion:
Under beta-blocker treatment for the last 2 weeks.

Annotated entities:
- Drug: "beta-blocker"
- Temporal: "for the last 2 weeks"